Clinical trial inclusion criterion:
Patients with surgical contraindication or reject to surgery.

Entity relations:
- AND("contraindication", "surgical")
- AND("reject", "surgery")
- OR("contraindication", "reject")